What is the function of the chromHMM software?

ChromHMM learns chromatin-state signatures using a multivariate hidden Markov model (HMM) that explicitly models the combinatorial presence or absence of each mark . It uses these signatures to generate a genome-wide annotation for each cell type by calculating the most probable state for each genomic segment . Chromatin states are learned, annotations are produced, and enrichments are computed within 1 d .